Clinical trial exclusion criterion:
Any patient who has been previously randomized in the EvK Trial.

Annotated entities:
- Procedure: "randomized"
- Temporal: "previously"